Clinical trial exclusion criterion:
Not seeking medication abortion

Annotated entities:
- Procedure: "medication abortion"